Which is the most common monogenic cause of common variable immunodeficiency (CVID) in Europeans?

Heterozygous loss-of-function nuclear factor kB subunit 1 (NFKB1) variants are the most common monogenic cause of common variable immunodeficiency in Europeans, which results in a temporally progressive defect in the formation of immunoglobulin-producing B cells.